History of head injury, seizures, or stroke

The above is a clinical trial exclusion criterion. Annotated with entity spans:
[Temporal: History] of [Condition: head injury], [Condition: seizures], or [Condition: stroke]